8. Unable to abstain from more than one beer or alcohol equivalent per day for the duration of the study

The above is a clinical trial exclusion criterion. Annotated with entity spans:
[Parsing_Error: 8.] [Non-query-able: Unable to abstain from more than one beer or alcohol equivalent per day for the duration of the study]